Previous randomization in this study

The above is a clinical trial exclusion criterion. Annotated with entity spans:
[Non-query-able: Previous randomization in this study]